Clinical trial exclusion criterion:
Active drug or alcohol use or dependence that would interfere with adherence to study requirements

Annotated entities:
- Condition: "alcohol use"
- Condition: "use"
- Condition: "drug dependence"
- Condition: "alcohol dependence"
- Qualifier: "would interfere with adherence to study requirements"
- Temporal: "Active"